Which are the properties of mammalian GA-sequences?

The article hypothesizes that genome navigation uses these properties of GA-sequences in the following way. At most 2% of the human GA-sequences were transcribed into mRNAs; all others were not coding for proteins. The article describes DNA sequences of mammalian genomes that are longer than 50 bases, but consist exclusively of G's and A's . Hence, guanine and thymine share significant properties regarding complementarity to adenine, while the TA and GA sequences can stack in at least two mutually compatible ways within the DNA duplexes analyzed here. Although not integral parts of them, Alu-elements were found immediately upstream of all human and chimpanzee GA-sequences with an upstream poly-segment. With the exception of a small number of poly-A-, poly-G-, poly-GA-, and poly-GAAA-sequences , all pure GA-sequences of the mammals tested were unique individuals, contained several repeated short GA-containing motifs, and shared a common hexa-nucleotide spectrum. In this article we identify for the first time explicitly the GA-sequences as a class of fractal genomic sequences that are easy to recognize and to extract, and are scattered densely throughout the chromosomes of a large number of genomes from different species and kingdoms including the human genome.